Clinical trial exclusion criterion:
Pre-existing dementia

Annotated entities:
- Condition: "dementia"
- Temporal: "Pre-existing"